Clinical trial exclusion criterion:
History of ischaemic heart disease, cardiac failure, cerebrovascular disease, liver impairment (ALT/AST>50IU/L) or stage 3-5 chronic kidney disease.

Annotated entities:
- Condition: "ischaemic heart disease"
- Condition: "cardiac failure"
- Condition: "cerebrovascular disease"
- Condition: "liver impairment"
- Measurement: "ALT"
- Measurement: "AST"
- Value: ">50IU/L"
- Measurement: "stage"
- Value: "3-5"
- Condition: "chronic kidney disease"